肝硬化會導致肝門靜脈高壓（portal hypertension），以下那種情況與肝門靜脈高壓的相關性較低？
A. 肝性腦病變（hepatic encephalopathy）
B. 食道靜脈曲張（esophageal varices）
C. 脾腫大併脾臟機能亢進（splenomegaly and hypersplenism）
D. 腹水（ascites）

正確答案：A. 肝性腦病變（hepatic encephalopathy）